Clinical trial exclusion criterion:
Previous history of ovarian surgery or surgical removal of one ovary.

Annotated entities:
- Procedure: "ovarian surgery"
- Procedure: "surgical removal"
- Qualifier: "ovary"
- Multiplier: "one"